在進行職業族群之標準死亡比（standardized mortality ratio，SMR）之研究時，常發現 SMR 低於 1.0，其最常見原因為：
A. 職業族群追蹤的不完全
B. 其他暴露因子未能完全受到考量
C. 職業暴露之錯誤分類
D. 健康工人效應

正確答案：D. 健康工人效應